En relación a la vacunación para el control de las enfermedades infecciosas, ¿qué se entiende por cobertura crítica?
1. Porcentaje de la población que debe estar inmunizada para que el potencial de transmisión del microorganismo sea < 3.
2. Porcentaje de la población que debe estar inmunizada para que el potencial de transmisión del microorganismo sea < 2.
3. Porcentaje de la población que debe estar inmunizada para que el potencial de transmisión del microorganismo sea < 1.
4. Porcentaje de la población que debe estar inmunizada para que el potencial de transmisión del microorganismo sea = 0.

Respuesta correcta: 3. Porcentaje de la población que debe estar inmunizada para que el potencial de transmisión del microorganismo sea < 1.